Clinical trial exclusion criterion:
Children will be excluded if they have a history of developmental delay or inability to communicate the effects of an allergic reaction (non-verbal).

Entity relations:
- AND("inability to communicate the effects", "allergic reaction")
- Has_qualifier("inability to communicate the effects", "non-verbal")
- OR("developmental delay", "inability to communicate the effects")